History or known presence of systemic autoimmune disorders potentially causing progressive neurologic disease (e.g., lupus, anti-phospholipid antibody syndrome, Sjogren's syndrome, Behçet's disease, sarcoidosis)

The above is a clinical trial exclusion criterion. Annotated with entity spans:
[Temporal: History] or known presence of [Condition: systemic autoimmune disorders] [Mood: potentially causing] [Condition: progressive neurologic disease] (e.g., [Condition: lupus], [Condition: anti-phospholipid antibody syndrome], [Condition: Sjogren's syndrome], [Condition: Behçet's disease], [Condition: sarcoidosis])